Clinical trial inclusion criterion:
Patients who test positive for HBsAg are ineligible

Annotated entities:
- Measurement: "HBsAg"
- Value: "positive"
- Grammar_Error: "are ineligible"